Clinical trial exclusion criteria:
contraindication to ketamine and lidocaine
patients involved to other studies
more or equal to American Society of Anesthesiologist (ASA) class III
not alert

Annotated entities:
- Drug: "ketamine"
- Drug: "lidocaine"
- Condition: "contraindication"
- Competing_trial: "patients involved to other studies"
- Measurement: "American Society of Anesthesiologist (ASA) class"
- Value: "III more or equal to"
- Observation: "not alert"